Clinical trial inclusion criterion:
High blood pressure (=130 mmHg systolic or =85mmHg diastolic), or on medication for treating the condition

Annotated entities:
- Value: "High"
- Measurement: "blood pressure"
- Condition: "High blood pressure"
- Value: "=130 mmHg systolic"
- Value: "=85mmHg diastolic"
- Drug: "medication for treating"